Contracted bladder

The above is a clinical trial exclusion criterion. Annotated with entity spans:
[Condition: Contracted bladder]